惡性氣管腫瘤的組織型態，下列何者最常見？
A. adenoid cystic carcinoma
B. adenocarcinoma
C. squamous cell carcinoma
D. small cell carcinoma

正確答案：C. squamous cell carcinoma